Failure to record HA data for at least 80% of days during the Screening Period

The above is a clinical trial exclusion criterion. Annotated with entity spans:
[Observation: Failure to record HA data] [Multiplier: for at least 80% of days] [Temporal: during the Screening Period]